Past history of breast cancer within recent 5 years before the currently diagnosed breast cancer.

The above is a clinical trial exclusion criterion. Annotated with entity spans:
Past history of [Condition: breast cancer] within [Temporal: recent 5 years before the currently diagnosed breast cancer].